Clinical trial inclusion criterion:
7. Subject is willing and able to undergo percutaneous intervention at SOS hospital, if randomized to SOS study arm.

Annotated entities:
- Procedure: "percutaneous intervention"
- Observation: "willing"
- Observation: "able"
- Visit: "SOS hospital"
- Post-eligibility: "Subject is willing and able to undergo percutaneous intervention at SOS hospital, if randomized to SOS study arm."